Clinical trial exclusion criterion:
1. Unable to ambulate at least 150 feet prior to stroke, or experienced intermittent claudication while walking;

Annotated entities:
- Parsing_Error: "1."
- Condition: "Unable to ambulate at least 150 feet"
- Temporal: "prior"
- Condition: "stroke"
- Reference_point: "stroke"
- Condition: "intermittent claudication"
- Qualifier: "while walking"